Clinical trial inclusion criterion:
Patients who agree to use an effective method of contraception throughout the clinical trial.

Annotated entities:
- Pregnancy_considerations: "Patients who agree to use an effective method of contraception throughout the clinical trial."